La luz ultravioleta produce mutaciones principalmente debido a que:
1. Induce desanimación oxidativa de la adenina y de la citosina.
2. Produce la eliminación de una base de la secuencia de bases.
3. Induce la formación de dímeros en secuencias que tengan TT.
4. Genera aumento de los tautómeros menos frecuentes de las bases.

Respuesta correcta: 3. Induce la formación de dímeros en secuencias que tengan TT.